Clinical trial inclusion criteria:
1. Are referred to the Cachexia Clinic with involuntary weight loss of >5% of their premorbid weight within the previous 6 months.
2. Are 18 years of age or older
3. Have a Karnofsky performance score of 60 or higher.
4. Can maintain oral food intake during the study
5. Can understand the study procedures and can sign an informed consent form.
6. Are not currently taking melatonin.
7. Are taking megestrol acetate and continue to lose weight despite at least 2 weeks of therapy.
8. Have a calculated creatinine clearance of >/= 60 cc/min.

Annotated entities:
- Visit: "Cachexia Clinic"
- Condition: "involuntary weight loss"
- Value: ">5% of their premorbid weight"
- Temporal: "within the previous 6 months"
- Person: "of age"
- Value: "18 years or older"
- Measurement: "Karnofsky performance score"
- Value: "60 or higher"
- Non-query-able: "Can maintain oral food intake during the study"
- Non-query-able: "Can understand the study procedures and can sign an informed consent form"
- Drug: "melatonin"
- Temporal: "currently"
- Negation: "not"
- Drug: "megestrol acetate"
- Observation: "lose weight"
- Temporal: "continue"
- Temporal: "at least 2 weeks"
- Procedure: "therapy"
- Temporal: "Are taking"
- Measurement: "calculated creatinine clearance"
- Value: ">/= 60 cc/min"